有關婦女懷孕的敘述，下列何者錯誤？
A. 若懷孕 6 週後切除卵巢，並不會影響其懷孕的進程
B. 婦女懷孕時，月經週期會被抑制，主要是因為血中動情素大量增加所致
C. 人類絨毛膜性腺激素（human chorionic gonadotropin）是由絨毛組織中滋養葉融合層細胞
D. 懷孕時胎兒腎上腺類皮質素（adrenal corticoid）的合成，需要胎盤協助合成其中間產物

正確答案：B. 婦女懷孕時，月經週期會被抑制，主要是因為血中動情素大量增加所致